¿Con qué autor o autores se asocia La Entrevista Motivacional?
1. Marlatt y Gordon.
2. Hunt y Azrin.
3. Carroll.
4. Miller y Rollnick.
5. Prochaska y Diclemente.

Respuesta correcta: 4. Miller y Rollnick.